Clinical trial exclusion criterion:
5. Women with a history of PCOS

Entity relations:
- Has_temporal("PCOS", "history")